Clostridium perfringens puede producir diversas infecciones, entre las que se encuentra:
1. El carbunco.
2. La colitis pseudomembranosa.
3. La gangrena gaseosa.
4. El tétanos.
5. El síndrome de la piel escaldada.

Respuesta correcta: 3. La gangrena gaseosa.